Clinical trial inclusion criteria:
Referred for surgery for open reduction and internal fixation for ankle fracture

Annotated entities:
- Procedure: "surgery"
- Procedure: "open reduction and internal fixation"
- Condition: "ankle fracture"